Clinical trial exclusion criterion:
Patient planned for or has had a revascularization procedure in the affected leg within the last 8 weeks

Annotated entities:
- Procedure: "revascularization procedure"
- Reference_point: "affected leg"
- Temporal: "within the last 8 weeks"
- Mood: "planned"
- Observation: "has had"